過敏性氣喘，主要的組織變化發生在：
A. 支氣管（major bronchi）
B. 小支氣管及細支氣管（small bronchi and bronchioles）
C. 肺泡（alveoli）
D. 肺微血管（capillaries）

正確答案：B. 小支氣管及細支氣管（small bronchi and bronchioles）